¿Cuál de los siguientes es un factor de mal pronóstico en las leucemias linfoblásticas agudas?:
1. Edad 1-9 años.
2. Fenotipo B.
3. Cariotipo con traslocación 9;22.
4. Leucocitosis de 25.000/microL.
5. Índice de ADN hiperploide.

Respuesta correcta: 3. Cariotipo con traslocación 9;22.